Clinical trial inclusion criterion:
Estimated life expectancy of at least 6 weeks following study entry

Annotated entities:
- Measurement: "Estimated life expectancy"
- Value: "at least 6 weeks following study entry"